一位 54 歲的女性，早晨起床困難有三週之久，身體檢查發現除兩腿無力之外，右臂上舉也有困難。但是兩手的握力正常。吞嚥時偶會嗆到。實驗室檢查發現 AST 75 U/L，ALT 14 U/L，ANA 1：80（＋） speckled，CK 805 U/L（MB form 635 μg/L），IgG 1720 mg/mL，IgA 354 mg/mL，IgM 213 mg/mL， mm/1h，78 mm/2h，CRP 0.76 mg/mL。這位患者最可能的診斷是：
A. polymyositis
B. myasthenia gravis
C. esophageal tumor
D. degenerative joint disease

正確答案：A. polymyositis